Clinical trial exclusion criterion:
use of medications that are inducers of CYP2A6 (a nicotine metabolizing enzyme) such as rifampicin, dexamethasone, phenobarbital, and other anti-convulsant drugs

Annotated entities:
- Drug: "medications"
- Qualifier: "inducers of CYP2A6"
- Drug: "nicotine metabolizing enzyme"
- Drug: "rifampicin"
- Drug: "dexamethasone"
- Drug: "phenobarbital"
- Drug: "anti-convulsant drugs"